一名84歲男性，因四天未解	，出現腹脹、陣發性腹痛等症	而被送到急診。病患先前有慢性便秘病史，沒 有接受過腹部手術，腹部X光檢查可看到明顯脹大之乙狀結腸，有bent inner tube sign。生命徵象穩定，理學檢查腹部有輕微壓痛，但無腹膜炎症狀，無腹股溝疝氣，下列初步處置何者最	想？
A. 立即剖腹探查
B. 胃鏡檢查
C. 乙狀結腸鏡檢查並減壓
D. 腹部超音波檢查

正確答案：C. 乙狀結腸鏡檢查並減壓